關於幼年型類風濕性關節炎（Juvenile idiopathic arthritis, JIA），下列何者錯誤？
A. 根據美國風濕病醫學會（ACR）診斷標準，關節炎需持續超過6週
B. 多關節型（Polyarthritis）JIA患者，風濕因子（Rheumatoid factor, RF）陽性者的預後較陰性者佳
C. 全身系統型（Systemic arthritis）的JIA患者，有時會併發巨噬細胞活化症候群（Macrophage activation syndrome），臨床表現為高燒，肝脾與淋巴結腫大，白血球減低等
D. 少關節型（Oligoarthritis）JIA患者容易併發慢性葡萄膜炎（Chronic uveitis）

正確答案：B. 多關節型（Polyarthritis）JIA患者，風濕因子（Rheumatoid factor, RF）陽性者的預後較陰性者佳